Clinical trial exclusion criterion:
Subject had any previous cardiac surgery, e.g. prosthetic valves.

Entity relations:
- Subsumes("cardiac surgery", "prosthetic valves")